Clinical trial inclusion criterion:
All patients admitted to the Duke CICU, who require intubation and sedation for mechanical ventilation that is expected to be >24 hours in duration will be included, unless they meet the specified exclusion criteria.

Annotated entities:
- Visit: "Duke CICU"
- Procedure: "admitted"
- Procedure: "intubation"
- Procedure: "sedation"
- Procedure: "mechanical ventilation"
- Multiplier: ">24 hours in duration"
- Mood: "expected to be"